Clinical trial exclusion criterion:
2. Diagnosis of acute promyelocytic leukemia

Annotated entities:
- Condition: "acute promyelocytic leukemia"